¿Qué es cierto del temblor esencial?
1. Generalmente mejora con propanolol.
2. Inicialmente es en reposo.
3. Puede mejorar con levodopa a dosis bajas.
4. Es más grave en los casos de presentación familiar.
5. Suele empeorar con la ingesta alcohólica.

Respuesta correcta: 1. Generalmente mejora con propanolol.